Clinical trial exclusion criterion:
Contraindication to neuraxial anesthesia

Entity relations:
- AND("Contraindication", "neuraxial anesthesia")